Adult patients (> 18 years) scheduled for cardiopulmonary bypass surgery with Glomerular Filtration Rate (GFR) greater than or equal to 60 and left ventricular ejection fraction greater than or equal to 40%

The above is a clinical trial inclusion criterion. Annotated with entity spans:
[Person: Adult] patients ([Value: > 18 years]) [Mood: scheduled for] [Procedure: cardiopulmonary bypass surgery] with [Measurement: Glomerular Filtration Rate (GFR)] [Value: greater than or equal to 60] and [Measurement: left ventricular ejection fraction] [Value: greater than or equal to 40%]